Clinical trial inclusion criterion:
aged = 8 months

Entity relations:
- Has_value("aged", "= 8 months")